下列何種絛蟲的蟲卵具有卵蓋（operculum）？
A. 單胞絛蟲（Echinococcus granulosus）
B. 牛肉絛蟲（Taenia saginata）
C. 廣節裂頭絛蟲（Diphyllobothrium latum）
D. 短小包膜絛蟲（Hymenolepis nana）

正確答案：C. 廣節裂頭絛蟲（Diphyllobothrium latum）